Unstable pulmonary embolism, deep vein thrombosis, or other significant arterial/venous thromboembolic event <=30 days before first dose of study treatment. If on anticoagulation, subject must be on stable therapeutic dose prior to first dose of study treatment.

The above is a clinical trial exclusion criterion. Annotated with entity spans:
[Qualifier: Unstable] [Condition: pulmonary embolism], [Condition: deep vein thrombosis], or [Qualifier: other] [Qualifier: significant] [Condition: arterial]/[Condition: venous thromboembolic event] [Temporal: <=30 days before first dose of study treatment]. If on [Procedure: anticoagulation], subject must be on [Qualifier: stable] [Multiplier: therapeutic dose] [Temporal: prior to first dose of study treatment].